下列何者屬於正向心理健康的表現？
A. 尊重接納他人
B. 忽視身體傷病
C. 壓抑負面情緒
D. 刻板社會角色

正確答案：A. 尊重接納他人